下列腦性麻痺（cerebral palsy）類型中，發生脊柱側彎（scoliosis）機率最低者為：
A. 四肢麻痺（quadriplegia）
B. 半身麻痺（hemiplegia）
C. 雙下肢麻痺（diplegia）
D. 兩下肢加一上肢麻痺（triplegia）

正確答案：C. 雙下肢麻痺（diplegia）